Clinical trial exclusion criterion:
Patients posing a serious suicidal risk and/or violence as judged by the investigator;

Annotated entities:
- Observation: "suicidal risk"
- Observation: "violence"